下列關於失智症（dementia）的敘述，何者錯誤？
A. 臨床上應與譫妄（delirium）作鑑別，且應排除可逆性之原因
B. 記憶力缺損常為早期表現，尤其是久遠之記憶
C. 阿茲海默氏症（Alzheimer's disease）為最常見之原因
D. Dementia with Lewy bodies（DLB）可能會有肌肉僵硬等類似帕金森氏症（Parkinson's disease）的症狀

正確答案：B. 記憶力缺損常為早期表現，尤其是久遠之記憶